Clinical trial exclusion criterion:
Mild Cognitive Impairment or Dementia

Entity relations:
- OR("Mild Cognitive Impairment", "Dementia")